Clinical trial exclusion criterion:
History of convulsions

Annotated entities:
- Temporal: "History"
- Condition: "convulsions"